En un paciente con enfermedad pulmonar obstructiva crónica (EPOC) leve en fase estable se evidencia poliglobulia e insuficiencia respiratoria. En la radiografía de tórax no se aprecian alteraciones reseñables. ¿Cuál de los siguientes procedimientos consideraría realizar en primer lugar para descartar la coexistencia de otras enfermedades que puedan justificar los hallazgos descritos?:
1. Poligrafía respiratoria.
2. Ecocardiograma.
3. Tomografía computarizada torácica.
4. Gammagrafía pulmonar.
5. Punción de médula ósea.

Respuesta correcta: 1. Poligrafía respiratoria.